HCV treatment-naïve, as defined as no prior exposure to any Interferon (IFN), RBV, or other FDA approved or experimental HCV-specific direct-acting antiviral agent

The above is a clinical trial inclusion criterion. Annotated with entity spans:
[Condition: HCV] [Procedure: treatment]-[Negation: naïve], as defined as [Negation: no] [Temporal: prior] exposure to any [Drug: Interferon (IFN)], [Drug: RBV], or [Non-representable: other FDA approved or experimental HCV-specific direct-acting antiviral agent]